Clinical trial inclusion criterion:
At the discretion of the operating surgeon, Bilirubin level of < 2.0 mg/dl in the absence of a history of Gilbert's disease (or pattern consistent with Gilbert's).

Entity relations:
- Has_value("Bilirubin level", "< 2.0 mg/dl")
- Has_negation("Gilbert's disease", "in the absence of")
- Has_temporal("Gilbert's disease", "history")